Clinical trial inclusion criterion:
5. HIV-negative as determined by a HIV rapid test at time of enrollment

Annotated entities:
- Condition: "HIV-negative"
- Measurement: "HIV"
- Value: "negative"
- Measurement: "HIV rapid test"
- Temporal: "at time of enrollment"
- Reference_point: "time of enrollment"